Para Kurt Lewin el conjunto de elementos que influyen en la conducta de un individuo en un momento dado conforman:
1. El espacio vital.
2. El lugar de control del reforzamiento.
3. Los mapas cognitivos.
4. La disonancia cognitiva.
5. El proceso de valoración orgánico.

Respuesta correcta: 1. El espacio vital.